Clinical trial inclusion criterion:
Affiliate to social security or beneficiary of such a regime

Annotated entities:
- Person: "Affiliate to social security"
- Person: "social security beneficiary"